What is the main difference between nascent and mature chromatin?

Nascent chromatin is created after transcription and is mostly lacking histone modifications and H1, which makes it more prone to digestion by DNaseI.